Patients with communication problems (critically ill, unconscious, language barrier despite use of secure telephone-based translation service)

The above is a clinical trial exclusion criterion. Annotated with entity spans:
Patients with [Condition: communication problems] ([Condition: critically ill], [Condition: unconscious], [Condition: language barrier] despite use of secure telephone-based translation service)